¿Cuál de los siguientes sistemas de prescripción terapéutica le parece el más adecuado para evitar errores en el tratamiento del paciente hospitalizado?
1. Informar directamente a la enfermera de más confianza.
2. Escribir de puño y letra todos los pormenores del tratamiento.
3. Dictar el tratamiento a la secretaria para que lo pase a la enfermera.
4. Cumplimentar el registro de prescripción electrónica.

Respuesta correcta: 4. Cumplimentar el registro de prescripción electrónica.